Clinical trial inclusion criterion:
Stable or unstable angina, including non ST-segment-elevation acute coronary syndrome (NSTE-ACS)

Annotated entities:
- Condition: "Stable angina"
- Condition: "unstable angina"
- Condition: "non ST-segment-elevation acute coronary syndrome"
- Condition: "NSTE-ACS"